What is the mechanism of action of Solriamfetol?

Solriamfetol is a selective norepinephrine-dopamine reuptake inhibitor. It is used to treat excessive sleepiness in obstructive sleep apnea and narcolepsy patients.